Clinical trial exclusion criterion:
Patients with active central nervous system (CNS) disease defined as symptomatic meningeal lymphoma or known CNS parenchymal lymphoma.

Annotated entities:
- Condition: "central nervous system (CNS) disease"
- Condition: "meningeal lymphoma"
- Qualifier: "symptomatic"
- Condition: "CNS parenchymal lymphoma"